Clinical trial exclusion criterion:
1. Orthopedic injuries that are unstable

Annotated entities:
- Parsing_Error: "1."
- Condition: "Orthopedic injuries"
- Qualifier: "unstable"